El error alcalino en el electrodo de vidrio se debe a
1. La membrana responde a otros aniones además del ion hidroxilo.
2. La membrana responde a otros aniones además del ion hidrógeno.
3. La membrana responde a otros cationes además del ion de hidrógeno.
4. Que el pH es mayor del que realmente es.
5. No está descrito ese error para el electrodo de vidrio.

Respuesta correcta: 3. La membrana responde a otros cationes además del ion de hidrógeno.